Clinical trial exclusion criterion:
study drug hypersensitivity

Entity relations:
- AND("hypersensitivity", "study drug")